Clinical trial inclusion criterion:
American Society of Anesthesiologists (ASA) physical status 1 to 3

Annotated entities:
- Measurement: "American Society of Anesthesiologists (ASA) physical status"
- Value: "1 to 3"